Clinical trial inclusion criterion:
Healthy postmenopausal women with 50 or more moderate to severe hot flushes.

Annotated entities:
- Condition: "postmenopausal"
- Condition: "Healthy"
- Person: "women"
- Value: "50 or more"
- Condition: "moderate to severe hot flushes"